母乳缺乏下列何種維他命？
A. Vit.A
B. Vit.D
C. Vit.E
D. Vit.K

正確答案：D. Vit.K